Received a new or ongoing prescription for at least one SGA (i.e., olanzapine, clozapine, risperidone, quetiapine, aripiprazole, ziprasidone, iloperidone, lurasidone, paliperidone, brexpiprazole or cariprazine) that is not prescribed as a PRN medication;

The above is a clinical trial inclusion criterion. Annotated with entity spans:
Received a new or ongoing prescription for [Multiplier: at least one] [Drug: SGA] (i.e., [Drug: olanzapine], [Drug: clozapine], [Drug: risperidone], [Drug: quetiapine], [Drug: aripiprazole], [Drug: ziprasidone], [Drug: iloperidone], [Drug: lurasidone], [Drug: paliperidone], [Drug: brexpiprazole] or [Drug: cariprazine]) that is not prescribed as a PRN medication;